Clinical trial exclusion criterion:
patients involved to other studies

Annotated entities:
- Competing_trial: "patients involved to other studies"